大腦初級聽覺皮質（primary auditory cortex）之傳入訊息，主要來自何處？
A. 內側膝狀體（medial geniculate body）
B. 上丘（superior colliculus）
C. 斜方體（trapezoid body）
D. 丘腦枕部（pulvinar of thalamus）

正確答案：A. 內側膝狀體（medial geniculate body）